Clinical trial exclusion criterion:
Complex or altered abdominal wall anatomy

Entity relations:
- OR("Complex abdominal wall anatomy", "altered abdominal wall anatomy")